Patients HIV+.

The above is a clinical trial exclusion criterion. Annotated with entity spans:
Patients [Condition: HIV+].